Clinical trial exclusion criterion:
Age <18 years or >75 years

Entity relations:
- Has_value("Age", "<18 years")
- OR("<18 years", ">75 years")